Clinical trial exclusion criterion:
Patients on strong CYP1A2 inhibitors: ciprofloxacin, fluvoxamine, methoxsalen, ofloxacin, primaquine

Entity relations:
- Subsumes("strong CYP1A2 inhibitors", "ciprofloxacin")
- OR("ciprofloxacin", "fluvoxamine", "methoxsalen", "ofloxacin", "primaquine")